下列何者不是原發性無月經症之可能原因？
A. Turner's syndrome
B. Swyer syndrome
C. Asherman syndrome
D. Rokitansky-Kűster-Hauser syndrome

正確答案：C. Asherman syndrome